Clinical trial exclusion criterion:
Patients with genetic diseases such as galactose intolerance, Lapp lactase deficiency, or glucose-galactose malabsorption.

Annotated entities:
- Condition: "genetic diseases"
- Condition: "galactose intolerance"
- Condition: "Lapp lactase deficiency"
- Condition: "glucose-galactose malabsorption"